Señale la afirmación correcta:
1. A pO2 bajas la mioglobina está más saturada de O2 que la hemoglobina.
2. El CO2 aumenta la afinidad de la hemoglobina por el O2.
3. El 2,3 bisfosfoglicerato está fuertemente unido en la hemoglobina oxigenada.
4. Los tejidos que producen lactato liberan más O 2.
5. A pO2 altas la hemoglobina tiene 2 subunidades.

Respuesta correcta: 1. A pO2 bajas la mioglobina está más saturada de O2 que la hemoglobina.